Clinical trial exclusion criterion:
Persons presently receiving or having a recent history of receiving (within the past six months) any medication or therapeutic modality that affects the immune system such as allergy shots, immune globulin, interferon, immunomodulators, radiation therapy, cytotoxic drugs or drugs known to be frequently associated with significant major organ toxicity, or systemic corticosteroids (oral or injectable). Inhaled and topical corticosteroids are allowed.

Annotated entities:
- Temporal: "within the past six months"
- Drug: "any medication"
- Procedure: "therapeutic modality"
- Qualifier: "affects the immune system"
- Drug: "allergy shots"
- Drug: "immune globulin"
- Drug: "interferon"
- Drug: "immunomodulators"
- Procedure: "radiation therapy"
- Drug: "cytotoxic drugs"
- Drug: "drugs known to be frequently associated with significant major organ toxicity"
- Qualifier: "known to be frequently associated with significant major organ toxicity"
- Drug: "systemic corticosteroids"
- Qualifier: "oral"
- Qualifier: "injectable"
- Grammar_Error: "Inhaled and topical corticosteroids are allowed."